Clinical trial exclusion criteria:
The patient has a known hypersensitivity or contraindication to any of the following medications: Heparin, Aspirin, Clopidogrel, Cilostazol
Uncontrolled hypertension
History of bleeding diathesis or known coagulopathy (including heparin-induced thrombocytopenia), or refuses blood transfusions.
Baseline hemogram with Hb<10g/dL or PLT count<100,000/μL
Patients already taking warfarin, cilostazol or any other type of anti-platelet agents except aspirin and clopidogrel
Gastrointestinal or genitourinary bleeding within the prior 3 months, or major surgery within 2 months.
Pregnancy

Annotated entities:
- Condition: "hypersensitivity"
- Condition: "contraindication"
- Drug: "Heparin"
- Drug: "Aspirin"
- Drug: "Clopidogrel"
- Drug: "Cilostazol"
- Qualifier: "Uncontrolled"
- Condition: "hypertension"
- Condition: "bleeding diathesis"
- Temporal: "History"
- Condition: "coagulopathy"
- Condition: "heparin-induced thrombocytopenia"
- Observation: "refuses blood transfusions"
- Procedure: "blood transfusions"
- Procedure: "hemogram"
- Temporal: "Baseline"
- Measurement: "Hb"
- Value: "<10g/dL"
- Measurement: "PLT count"
- Value: "<100,000/μL"
- Drug: "warfarin"
- Drug: "cilostazol"
- Drug: "anti-platelet agents"
- Drug: "aspirin"
- Drug: "clopidogrel"
- Negation: "except"
- Condition: "genitourinary bleeding"
- Condition: "Gastrointestinal bleeding"
- Temporal: "within the prior 3 months"
- Procedure: "major surgery"
- Temporal: "within 2 months"
- Condition: "Pregnancy"